Patients in the cardiothoracic intensive care after cardiac surgery with cardiopulmonary bypass

The above is a clinical trial inclusion criterion. Annotated with entity spans:
Patients in the [Visit: cardiothoracic intensive care] [Temporal: after cardiac surgery with cardiopulmonary bypass]